Clinical trial exclusion criterion:
Serum bilirubin > 5.0mg/dl

Entity relations:
- Has_value("Serum bilirubin", "> 5.0mg/d")